Clinical trial inclusion criterion:
Patients without prostatectomy: 2 consecutive rises in PSA levels relative to a previous reference value, separated by one month. The first measurement must occur one month after the reference value and must be above the reference value. The second confirmatory measurement taken one month after the first measurement must be greater than the first measurement.

Annotated entities:
- Procedure: "prostatectomy"
- Negation: "without"
- Measurement: "PSA levels"
- Value: "rises"
- Value: "2"
- Temporal: "consecutive"
- Temporal: "separated by one month"
- Temporal: "one month after the reference value"
- Value: "above the reference value"
- Value: "first"
- Procedure: "measurement"
- Value: "second"
- Procedure: "measurement"
- Temporal: "one month after the first measurement"
- Value: "greater than the first measurement"